A un paciente de 40 años, clasificado como ASA I según la escala de la American Society of Anesthesiologists, se le está practicando una colecistectomía      laparoscópica    por    una colelitiasis.   La     intervención    transcurre inicialmente sin complicaciones, pero a los cincuenta minutos de iniciada la misma se observa un incremento significativo de los niveles de dióxido de carbono (CO2) teleespiratorios, sin alteración de la saturación arterial de oxígeno por pulsioximetría ni elevación de las presiones de ventilación. ¿Cuál sería su diagnóstico de presunción y su actitud ante este hallazgo?
1. Con estos hallazgos hay que sospechar la existencia de un enfisema subcutáneo, por lo que hay que explorar al paciente y solicitar que se disminuya la presión de insuflación del neumoperitoneo o incluso la interrupción del mismo.
2. El diagnóstico más probable es un neumotórax secundario a dióxido de carbono o capnotórax, por lo que hay que solicitar una radiografía de tórax urgente y preparar la inserción de un drenaje torácico.
3. La elevación de los niveles de dióxido de carbono es normal en el marco de una intervención laparoscópica. La única actitud a tomar es aumentar el volumen minuto en la máquina anestésica.
4. Hay que revisar la colocación del tubo orotraqueal por la posibilidad de que haya progresado y que estemos ante una intubación endobronquial, lo que resulta relativamente frecuente en esta cirugía por causa de la elevación del diafragma secundaria al neumoperitoneo.
5. La elevación del dióxido de carbono teleespiratorio, sin afectación de las presiones de ventilación, es típico del embolismo pulmonar masivo. Hay que interrumpir la intervención, ventilar con oxígeno puro y preparar drogas vasoactivas por la posible inestabilidad hemodinámica.

Respuesta correcta: 1. Con estos hallazgos hay que sospechar la existencia de un enfisema subcutáneo, por lo que hay que explorar al paciente y solicitar que se disminuya la presión de insuflación del neumoperitoneo o incluso la interrupción del mismo.